Current smoker;

The above is a clinical trial exclusion criterion. Annotated with entity spans:
Current [Person: smoker];